Clinical trial inclusion criterion:
Metabolic function, as follows: Serum Magnesium within normal limits. Serum Calcium within normal limits. Serum Potassium within normal limits.

Annotated entities:
- Measurement: "Serum Magnesium"
- Value: "within normal limits"
- Measurement: "Serum Calcium"
- Value: "within normal limits"
- Measurement: "Serum Potassium"
- Value: "within normal limits"